What is caused by heterozygous lamin B1 and lamin B2 variants?

Heterozygous lamin B1 and laminB2 variants cause primary microcephaly and define a novel laminopathy.